Which type of pluripotency is Otx2 associated with?

Otx2 is an intrinsic determinant of the embryonic stem cell state and is required to stabilize the EpiSC state by suppressing the mesendoderm-to-neural fate switch by suppressing BMP4 and FGf2.